The cirrhotic malnourished patients who were diagnosed as liver cancer preoperatively and underwent hepatectomy were consecutively enrolled.

The above is a clinical trial inclusion criterion. Annotated with entity spans:
The [Condition: cirrhotic] [Condition: malnourished] patients who were diagnosed as [Condition: liver cancer] [Temporal: preoperatively] and underwent [Procedure: hepatectomy] were consecutively enrolled.